3. Be able and willing to follow instructions, including participation in all study assessments and visits.

The above is a clinical trial inclusion criterion. Annotated with entity spans:
[Parsing_Error: 3.] [Post-eligibility: Be able and willing to follow instructions, including participation in all study assessments and visits.]